Acute ST-segment-elevation myocardial infarction (STEMI)

The above is a clinical trial exclusion criterion. Annotated with entity spans:
[Condition: Acute ST-segment-elevation myocardial infarction] ([Condition: STEMI])